Clinical trial exclusion criterion:
Subjects under 18 years of age

Annotated entities:
- Value: "under 18 years"
- Person: "age"